Clinical trial exclusion criterion:
tramadol

Annotated entities:
- Drug: "tramadol"